Clinical trial exclusion criterion:
Has a transplanted organ (with the exception of a corneal transplant performed >= 3 months prior to baseline)

Annotated entities:
- Procedure: "transplanted organ"
- Procedure: "corneal transplant"
- Temporal: ">= 3 months prior to baseline"
- Negation: "exception of"